Pregnant women who breast-feed or test positive for pregnancy

The above is a clinical trial exclusion criterion. Annotated with entity spans:
[Condition: Pregnant] [Person: women] who [Condition: breast-feed] or [Measurement: test] [Value: positive] for pregnancy